Clinical trial exclusion criterion:
Allergy, or have experienced any drug reaction to ketamine

Annotated entities:
- Condition: "Allergy"
- Condition: "drug reaction"
- Drug: "ketamine"